Which are the most under-represented oligonucleotides in higher eukaryote genomes?

Oligonucleotides containing CG and TA dinucleoides